What is the function of CR elements in B-cells?

CR elements are subtelomeric protein complexes that repress translation of a subset of RNAs in response to abiotic stress and can mediate diverse physiological and developmental processes in B- cells.